Newborns with any contraindications to routine circumcision, anatomical or hematologic.

The above is a clinical trial exclusion criterion. Annotated with entity spans:
[Person: Newborns] with any [Condition: contraindications] to routine [Procedure: circumcision], anatomical or hematologic.